Clinical trial exclusion criterion:
Chronic Pulmonary Condition other than asthma

Entity relations:
- Has_negation("asthma", "other")